Clinical trial inclusion criterion:
Ankle-brachial pressure index above 0.7.

Annotated entities:
- Measurement: "Ankle-brachial pressure index"
- Value: "above 0.7"